Clinical trial exclusion criterion:
The participant has Modified Hoehn & Yahr stage 5 (or stage 5 at eather on-time or off-time for the participant with wearing off phenomenon).

Annotated entities:
- Measurement: "Modified Hoehn & Yahr"
- Value: "stage 5"
- Condition: "wearing off phenomenon"
- Temporal: "at on-time"
- Temporal: "at off-time"
- Value: "stage 5"